Clinical trial exclusion criterion:
Women requiring hysterectomy for treatment of H Mole

Entity relations:
- AND("hysterectomy", "H Mole")